Clinical trial exclusion criterion:
Tobacco use within 3 months of enrollment and throughout first 6 months of the study

Entity relations:
- Has_index("within 3 months of enrollment", "enrollment")
- Has_temporal("Tobacco use", "within 3 months of enrollment")
- Has_index("throughout first 6 months of the study", "the study")
- Has_temporal("Tobacco use", "throughout first 6 months of the study")